History of adverse reaction to a-2 adrenergic agonists

The above is a clinical trial exclusion criterion. Annotated with entity spans:
History of [Condition: adverse reaction] to [Drug: a-2 adrenergic agonists]